Clinical trial exclusion criterion:
Chemotherapy and radiotherapy

Entity relations:
- OR("Chemotherapy", "radiotherapy")